Confirmed diagnosis of non-Burkitt B-lineage ALL

The above is a clinical trial inclusion criterion. Annotated with entity spans:
[Qualifier: Confirmed] diagnosis of [Condition: non-Burkitt B-lineage ALL]